Clinical trial exclusion criterion:
Patients using monoamine oxidase inhibitors.

Annotated entities:
- Drug: "monoamine oxidase inhibitors"